Female at birth and identifies as female gender

The above is a clinical trial inclusion criterion. Annotated with entity spans:
[Person: Female] [Temporal: at birth] and identifies as [Value: female] [Person: gender]